Clinical trial inclusion criterion:
have CAC between 10 to <1000, and

Annotated entities:
- Measurement: "CAC"
- Value: "between 10 to <1000"